Which genes are more frequently affected by somatic mutations in Chronic Lymphocytic Leukemia

TP53, ATM, NOTCH1, XPO1, MYD88, KLHL6, SF3B1, ZMYM3, MAPK1, FBXW7 and DDX3X